History of intracranial hemorrhage

The above is a clinical trial exclusion criterion. Annotated with entity spans:
[Temporal: History] of [Condition: intracranial hemorrhage]